Clinical trial inclusion criterion:
women previously diagnosed with localized vestibulodynia,

Annotated entities:
- Condition: "localized vestibulodynia"
- Person: "women"